Sacral sparing 是代表不完全脊髓損傷（Incomplete spinal cord injury），下列何者不屬於 Sacral sparing？
A. 肛門周圍有感覺（Perianal sensation）
B. 肛門可自主收縮（Voluntary anal contraction）
C. 大拇趾可屈曲（Great toe flexion）
D. 大拇趾可伸展（Great toe extension）

正確答案：D. 大拇趾可伸展（Great toe extension）